Clinical trial exclusion criterion:
Patients who receive a graft from a cadaver donor.

Annotated entities:
- Procedure: "graft from a cadaver donor"